Clinical trial inclusion criterion:
Clinical and radiologic diagnosis of primary knee osteoarthritis (Kellgren & Lawrence I, II or III);

Entity relations:
- Has_value("Kellgren & Lawrence", "I, II or III")
- AND("primary knee osteoarthritis", "Kellgren & Lawrence")
- Has_qualifier("primary knee osteoarthritis", "radiologic diagnosis")
- Has_qualifier("primary knee osteoarthritis", "Clinical diagnosis")